下列病毒與其自然宿主之配對，何者錯誤？
A. 黃熱病病毒（Yellow fever virus）與鳥類
B. 登革熱病毒（Dengue virus）與人類、猴子
C. 日本腦炎病毒（Japanese encephalitis virus）與鳥類、豬
D. 聖路易斯腦炎病毒（St. Louis encephalitis virus）與鳥類

正確答案：A. 黃熱病病毒（Yellow fever virus）與鳥類